Clinical trial exclusion criterion:
Compromised neurologic status on exam (specifically assessment of radial, ulnar, and median nerve)

Entity relations:
- Has_qualifier("Compromised neurologic status", "median nerve")
- OR("median nerve", "nerve ulnar", "nerve radial")